What is Fuchs' Uveitis?

Fuchs uveitis (FU) is a frequent, chronic course of intraocular inflammation,